Clinical trial exclusion criterion:
Patients who cannot or do not want to give informed consent (including language barriers)

Entity relations:
- Has_negation("give informed consent", "cannot")
- OR("cannot", "do not want to")
- OR("give informed consent", "language barriers")